History of erythropoietin, i. v. or oral iron therapy, and blood transfusion in previous 12 weeks and/or such therapy planned within the next 6 months.

The above is a clinical trial exclusion criterion. Annotated with entity spans:
History of [Drug: erythropoietin], [Procedure: i. v.] or [Procedure: oral iron therapy], and [Procedure: blood transfusion] [Temporal: in previous 12 weeks] and/or such therapy [Mood: planned] [Temporal: within the next 6 months].